Clinical trial inclusion criterion:
Ongoing treatment with antidepressants

Entity relations:
- AND("treatment", "antidepressants")
- Has_temporal("treatment", "Ongoing")